Which R/bioconductor package exists for discovery of intergenic transcripts?

PRAM (Pooling RNA-seq and Assembling Models) is a novel pooling approach for discovering intergenic transcripts from large-scale RNA sequencing experiments.